Clinical trial exclusion criterion:
Inability to discontinue oral anticoagulant 2-5 days prior to study treatment

Annotated entities:
- Drug: "oral anticoagulant"
- Temporal: "2-5 days prior to study treatment"
- Reference_point: "study treatment"
- Non-query-able: "Inability to discontinue oral anticoagulant 2-5 days prior to study treatment"